Clinical trial exclusion criterion:
5. Nursing women

Entity relations:
- AND("women", "Nursing")